Histologically confirmed diagnosis of unresectable, recurrent, and/or metastatic high grade soft-tissue or bone sarcoma of one of the following subtypes: soft tissue sarcomas (leiomyosarcoma, poorly differentiated/de-differentiated liposarcoma, high grade pleomorphic undifferentiated sarcoma/MFH and synovial sarcoma), and bone sarcomas (Ewing sarcoma, osteosarcoma, and chondrosarcoma [de-differentiated or mesenchymal]).

The above is a clinical trial inclusion criterion. Annotated with entity spans:
[Procedure: Histologically] [Value: confirmed] diagnosis of [Qualifier: unresectable], [Temporal: recurrent], and/or [Qualifier: metastatic] [Qualifier: high grade] [Condition: soft-tissue] or [Condition: bone sarcoma] of one of the following subtypes: [Condition: soft tissue sarcomas] ([Condition: leiomyosarcoma], [Qualifier: poorly differentiated]/[Qualifier: de-differentiated] [Condition: liposarcoma], [Qualifier: high grade] [Qualifier: pleomorphic] [Qualifier: undifferentiated] [Condition: sarcoma]/[Condition: MFH] and [Condition: synovial sarcoma]), [Grammar_Error: and] [Condition: bone sarcomas] ([Condition: Ewing sarcoma], [Condition: osteosarcoma], and [Condition: chondrosarcoma] [[Qualifier: de-differentiated] or [Qualifier: mesenchymal]]).